Clinical trial inclusion criteria:
Men and women 18-89 years old
with the diagnosis of sepsis (as specified below) within the previous 24 hours
who require mechanical ventilation, and
provide informed consent either personally or by an authorized representative.

Annotated entities:
- Person: "Men"
- Person: "women"
- Person: "old"
- Value: "18-89 years"
- Condition: "sepsis"
- Temporal: "within the previous 24 hours"
- Procedure: "mechanical ventilation"
- Informed_consent: "provide informed consent either personally or by an authorized representative"